Life expectancy of less than 3 years, due to intercurrent disease, especially neoplastic,

The above is a clinical trial exclusion criterion. Annotated with entity spans:
[Measurement: Life expectancy] of [Value: less than 3 years], [Non-representable: due to] [Condition: intercurrent disease], especially [Condition: neoplastic],